El ácido p-nitrobenzoico es:
1. Menos ácido que el ácido benzoico.
2. Menos ácido que el ácido p-metoxibenzoico.
3. Más ácido que el ácido benzoico y con menor pKa.
4. Más ácido que el ácido benzoico y con mayor pKa.
5. Menos ácido que el ácido p-metoxibenzoico y con menor pKa.

Respuesta correcta: 3. Más ácido que el ácido benzoico y con menor pKa.